Para las teorías clásicas de automaticidad ¿Qué caracteriza a los procesos automáticos frente a los controlados?:
1. Los procesos automáticos se hallan bajo control de las intenciones de la persona.
2. Los procesos automáticos consumen gran capacidad atencional.
3. Los procesos automáticos procesan la información sólo de forma secuencial.
4. Los procesos automáticos consumen gran cantidad de tiempo.
5. Los procesos automáticos no tienen por qué acceder al conocimiento consciente.

Respuesta correcta: 5. Los procesos automáticos no tienen por qué acceder al conocimiento consciente.